The patient has a known hypersensitivity or contraindication to any of the following medications: Heparin, Aspirin, Clopidogrel, Cilostazol

The above is a clinical trial exclusion criterion. Annotated with entity spans:
The patient has a known [Condition: hypersensitivity] or [Condition: contraindication] to any of the following medications: [Drug: Heparin], [Drug: Aspirin], [Drug: Clopidogrel], [Drug: Cilostazol]